Patients with cardiac problem

The above is a clinical trial exclusion criterion. Annotated with entity spans:
Patients with [Condition: cardiac problem]